Clinical trial exclusion criterion:
Retinal diseases potentially requiring treatment during the following 3 months

Annotated entities:
- Temporal: "during the following 3 months"
- Procedure: "treatment"
- Mood: "requiring"
- Condition: "Retinal diseases"